Clinical trial exclusion criterion:
< 37-0 weeks of gestation

Annotated entities:
- Value: "< 37-0 weeks"
- Measurement: "gestation"